關於猝睡症（narcolepsy）的敘述，下列何者錯誤？
A. 常發生在15到20歲之間
B. 下視丘過誤瘤（hypothalamic harmatoma）及腦幹中風為常見的病因之一
C. 無法控制的入睡衝動及情緒激動時發生肌肉張力的瞬間消失，為其主要特徵
D. 治療以modafinil、methylphenidate 或amphetamines等stimulant drugs為主

正確答案：B. 下視丘過誤瘤（hypothalamic harmatoma）及腦幹中風為常見的病因之一